一位 36 歲女性，因 2 天來雙腿無力、麻木而來急診室。神經檢查顯示下肢無力，只能水平移動，肌腱反射增強，有兩側的 Babinski sign，兩側下肢對疼痛之感覺降低，一直到肚臍部位。最可能之診斷是：
A. 脊髓病變（spinal cord lesion）
B. 周邊神經病變（peripheral neuropathy）
C. 肌肉病變（muscle disorder）
D. 癔病（conversion disorder）

正確答案：A. 脊髓病變（spinal cord lesion）